75 歲的李老太太因中風住院，總醫師檢查後懷疑李老太太腦幹中風（brainstem stroke），最佳的影像檢查為何？
A. 血管攝影（Angiogram）
B. 單光子攝影（SPECT）
C. 電腦斷層攝影（CT）
D. 核磁共振攝影（MRI）

正確答案：D. 核磁共振攝影（MRI）